Clinical trial exclusion criterion:
Prior radiotherapy for primary tumor

Annotated entities:
- Procedure: "radiotherapy"
- Temporal: "Prior"
- Qualifier: "primary"
- Condition: "tumor"